Han Wistar and Sprague Dawley are breeds of what laboratory animal?

Han Wistar and Sprague Dawley are breeds of Rats